Type 1 diabetes mellitus or diabetic ketoacidosis

The above is a clinical trial exclusion criterion. Annotated with entity spans:
[Condition: Type 1 diabetes mellitus] or [Condition: diabetic ketoacidosis]